Primary symptom of chest pain

The above is a clinical trial inclusion criterion. Annotated with entity spans:
[Qualifier: Primary symptom] of [Condition: chest pain]